Unable to provide consent

The above is a clinical trial exclusion criterion. Annotated with entity spans:
[Informed_consent: Unable to provide consent]